Clinical trial exclusion criterion:
Life-time history of DSM 5 schizophrenia, bipolar disorder, or previous psychosis with or intolerance to cannabinoids

Annotated entities:
- Qualifier: "DSM 5"
- Condition: "schizophrenia"
- Condition: "bipolar disorder"
- Condition: "psychosis"
- Condition: "intolerance"
- Drug: "cannabinoids"